Clinical trial inclusion criterion:
1. Males and females age ≥18 years in second relapse or refractory.

Annotated entities:
- Person: "Males"
- Person: "females"
- Person: "age"
- Value: "≥18 years"
- Condition: "relapse"
- Condition: "refractory"
- Multiplier: "second"